Clinical trial inclusion criterion:
Pulmonary lesion consistent with TB by radiological examination

Annotated entities:
- Condition: "Pulmonary lesion"
- Condition: "TB"
- Procedure: "radiological examination"
- Qualifier: "consistent with TB"